Patients with epilepsy requiring medications (such as steroids or antiepileptic drugs)

The above is a clinical trial exclusion criterion. Annotated with entity spans:
Patients with [Condition: epilepsy] requiring [Drug: medications] (such as [Drug: steroids] or [Drug: antiepileptic drugs])